一位農夫因噴灑農藥而中毒，當送至急診室時，出現胸悶、瞳孔縮小、視力模糊和唾液分泌過多等症狀，此時應給予何種藥物治療之？
A. Atropine
B. Physostigmine
C. Propantheline
D. Edrophonium

正確答案：A. Atropine